下列那一個路徑是以glutamate為傳遞物質的興奮性路徑？
A. subthalamic nucleus  →  globus pallidus internal segment
B. globus pallidus internal segment  →  thalamus
C. globus pallidus external segment  →  globus pallidus internal segment
D. putamen  →  globus pallidus external segment

正確答案：A. subthalamic nucleus  →  globus pallidus internal segment